下列有關政府課徵菸品健康捐的敘述，那一項錯誤？
A. 對青少年的菸品使用量影響較大，因為青少年對香菸價格比較敏感，導致減少的吸菸量較多
B. 以個人總體課徵金額而言，傾向於向低社會階層課較重的稅，因為低社會階層菸品使用量較大
C. 總體而言，菸品價格上升，可以降低菸品的使用量，提升人民的健康狀態
D. 因為菸品的使用量下降，因此政府的總體稅收會減少

正確答案：D. 因為菸品的使用量下降，因此政府的總體稅收會減少